Clinical trial inclusion criterion:
Patients undergoing SSRF at Denver Health Medical Center

Annotated entities:
- Procedure: "SSRF"
- Visit: "Denver Health Medical Center"